Clinical trial inclusion criterion:
HbA1c = 9% if on triple therapy or = 10% on diet & exercise or monotherapy or dual therapy

Annotated entities:
- Measurement: "HbA1c"
- Value: "= 9%"
- Value: "= 10%"